Clinical trial exclusion criterion:
Patients with a history of hypothyroidism unless taking a stable dose of thyroid medication and asymptomatic or euthyroid for 6 months;

Entity relations:
- Has_negation("thyroid medication", "unless")
- AND("hypothyroidism", "thyroid medication")